El cuadrado de coeficiente de correlación de Pearson es:
1. El coeficiente de variación.
2. El coeficiente de determinación.
3. La pendiente de la recta de regresión.
4. El coeficiente de regresión.
5. La covarianza.

Respuesta correcta: 2. El coeficiente de determinación.